biopsy proven NASH

The above is a clinical trial inclusion criterion. Annotated with entity spans:
[Procedure: biopsy] proven [Condition: NASH]